Clinical trial exclusion criterion:
Acute myocardial infarction identified by ECG

Annotated entities:
- Condition: "Acute myocardial infarction"
- Procedure: "ECG"